Clinical trial inclusion criterion:
Ulcers whose major axis measured with the electronic caliper is ≥ 2 mm

Entity relations:
- Has_qualifier("major axis", "measured with the electronic caliper")
- Has_value("major axis", "≥ 2 mm")
- AND("Ulcers", "major axis")